What is the Formalin test used for?

Persistent pain, In vivo antinociceptive activity, is produced by peripheral tissue injury and inflammation and is modeled by formalin test.